下列何種統計指標較不受極端值的影響？
A. 平均值（Mean）
B. 第 75 百分位數（The 75th percentile）
C. 樣本標準差（Standard deviation）
D. 樣本標準誤（Standard error）

正確答案：B. 第 75 百分位數（The 75th percentile）